Clinical trial inclusion criterion:
Osteoporosis

Annotated entities:
- Condition: "Osteoporosis"